Clinical trial inclusion criterion:
INR = 1.5 x ULN unless subject has known hemophilia or is stable on an anticoagulant regimen affecting INR.

Annotated entities:
- Measurement: "INR"
- Value: "= 1.5 x ULN"
- Condition: "hemophilia"
- Condition: "stable on an anticoagulant regimen affecting INR"
- Negation: "unless"